Subjects receiving an investigational agent (including different formulation and generic agents of investigational drug) in the previous 3 months prior to screening.

The above is a clinical trial exclusion criterion. Annotated with entity spans:
[Competing_trial: Subjects receiving an investigational agent (including different formulation and generic agents of investigational drug) in the previous 3 months prior to screening.]